Clinical trial inclusion criteria:
Subjects who, in the opinion of the investigator, can and will comply with the requirements of the protocol.
Written informed consent obtained from the subject prior to performing any study specific procedure.
A male or female between, and including, 18 and 50 years of age at the time of the first study visit.
Healthy subjects as established by medical history and clinical examination before entering into the study. Healthy subjects with no medical conditions that, in the opinion of the investigator, prevents the subject from participating in the study.
Subjects must weigh at least 110 pounds (50 kg), but not to present obesity (BMI < 32kg/m2).
Female subjects of non-childbearing potential may be enrolled in the study. Non-childbearing potential is defined as pre-menarche, current bilateral tubal ligation or occlusion, hysterectomy, bilateral ovariectomy or post-menopause.
has practiced adequate contraception for 30 days prior to vaccination, and
has a negative pregnancy test on the day of vaccination and
has agreed to continue adequate contraception during the entire treatment period and for 1 month, after completion of the vaccination series.

Annotated entities:
- Non-query-able: "in the opinion of the investigator"
- Observation: "comply with the requirements of the protocol"
- Observation: "Written informed consent"
- Procedure: "study specific procedure"
- Temporal: "prior to performing any study specific procedure"
- Reference_point: "performing any study specific procedure"
- Person: "male"
- Person: "female"
- Value: "18 and 50 years"
- Person: "age"
- Temporal: "at the time of the first study visit"
- Reference_point: "the first study visit"
- Condition: "Healthy"
- Temporal: "medical history"
- Procedure: "clinical examination"
- Temporal: "before entering into the study"
- Reference_point: "entering into the study"
- Non-query-able: "Healthy subjects with no medical conditions that, in the opinion of the investigator, prevents the subject from participating in the study."
- Measurement: "weigh"
- Value: "at least 110 pounds"
- Value: "at least 50 kg"
- Condition: "obesity"
- Measurement: "BMI"
- Negation: "not to present"
- Value: "< 32kg/m2"
- Person: "Female"
- Negation: "non-"
- Observation: "childbearing potential"
- Observation: "pre-menarche"
- Temporal: "current"
- Condition: "bilateral tubal ligation"
- Condition: "bilateral tubal occlusion"
- Condition: "hysterectomy"
- Procedure: "bilateral tubal ligation"
- Procedure: "bilateral tubal occlusion"
- Condition: "bilateral ovariectomy"
- Observation: "post-menopause"
- Procedure: "bilateral ovariectomy"
- Observation: "contraception"
- Qualifier: "adequate"
- Temporal: "30 days prior to vaccination"
- Reference_point: "vaccination"
- Value: "negative"
- Measurement: "pregnancy test"
- Temporal: "on the day of vaccination"
- Reference_point: "vaccination"
- Multiplier: "continue"
- Observation: "adequate contraception"
- Temporal: "during the entire treatment period"
- Temporal: "for 1 month, after completion of the vaccination series"
- Reference_point: "completion of the vaccination series"